Singleton pregnancy

The above is a clinical trial inclusion criterion. Annotated with entity spans:
[Condition: Singleton pregnancy]